有關產前胎兒健康評估的生物生理計分法（biophysical profile）之敘述，下列何者錯誤？
A. 胎兒生物物理指標最高分為 12 分
B. 胎兒生物物理指標若為 0 分，代表有意義的胎兒酸血症（fetal acidosis）
C. 若分數從原本的 2 或 4 分變成 0 分，表示可更準確的預測不正常的結果
D. 分數 10 分不一定表示胎兒血液 pH 值正常

正確答案：A. 胎兒生物物理指標最高分為 12 分